Clinical trial exclusion criterion:
9. Prior participation in this study.

Annotated entities:
- Context_Error: "Prior participation in this study."